Clinical trial exclusion criterion:
Past history of systemic steroid use over 2 weeks within the last 2 years

Entity relations:
- Has_temporal("systemic steroid", "Past history")
- Has_temporal("systemic steroid", "over 2 weeks")
- Has_temporal("systemic steroid", "within the last 2 years")